Clinical trial exclusion criterion:
Application of preparations of immune globulin or blood transfusion within last three months prior to clinical studies;

Entity relations:
- Has_temporal("preparations of immune globulin", "within last three months prior to clinical studies")
- OR("preparations of immune globulin", "blood transfusion")